Which organs are primarily damaged in SLE?

The patients with SLE are mostly affected by renal, peripheral vascular, musculoskeletal and neurological damage. The skin and heart are also damaged very frequently.